La vitamina K es el antagonista específico para:
1. Anticoagulantes orales.
2. Insulina.
3. Paracetamol.
4. Heparina.
5. Opiáceos.

Respuesta correcta: 1. Anticoagulantes orales.